History of at least two moderate or severe exacerbations that required change in treatment (antibiotics, systemic steroids, hospitalization) in the last 18 months prior to date of screening , with at least one of these occurring within the last 12 months prior to screening.

The above is a clinical trial inclusion criterion. Annotated with entity spans:
History of [Multiplier: at least two] [Qualifier: moderate] or [Qualifier: severe] [Condition: exacerbations] that [Qualifier: required change in treatment] ([Drug: antibiotics], [Drug: systemic steroids], [Procedure: hospitalization]) [Temporal: in the last 18 months prior to date of screening] , with [Multiplier: at least one] of these occurring [Temporal: within the last 12 months prior to screening].